咳血（hemoptysis）之血液，最可能來自下列何者？
A. 肺動脈（pulmonary artery）
B. 肺靜脈（pulmonary vein）
C. 支氣管動脈（bronchial artery）
D. 支氣管靜脈（bronchial vein）

正確答案：C. 支氣管動脈（bronchial artery）